張先生 62 歲，高血壓服藥多年，今早上班時，因前胸撕裂性疼痛並延伸到背部，上肢血壓右側 128/76 mmHg，左側 102/68 mmHg，心臟聽診有第二度收縮期雜音，下列非侵襲性檢查何者對診斷最有幫助？
A. 胸部 X 光
B. 心電圖
C. 胸部包含頸部電腦斷層
D. 杜卜勒（Doppler）超音波心圖

正確答案：C. 胸部包含頸部電腦斷層